Clinical trial exclusion criterion:
planning to move in next 12-24 months

Annotated entities:
- Mood: "planning to move"
- Temporal: "in next 12-24 months"